Clinical trial inclusion criterion:
Body mass index > 35 and < 50 kg/m2

Entity relations:
- Has_value("Body mass index", "> 35 and < 50 kg/m2")